Clinical trial inclusion criterion:
planned to undergo PCI recently

Entity relations:
- Has_mood("PCI", "planned to undergo")
- Has_temporal("PCI", "recently")